一般而言，血管性失智症（vascular dementia）的病人，多具有下列何種特徵？
A. 多重血管危險因子
B. 動作遲緩，肢體僵硬，尤以上肢為最
C. 很少出現憂鬱症狀
D. 很久以後才會出現大小便失禁

正確答案：A. 多重血管危險因子